In which cell organelle is the SAF-A protein localized?

TheSAF-A protein is localized to the nuclear matrix